Clinical trial inclusion criterion:
AND identical isolate in urine sample (>= 1.000 CFU) OR relevant clinical signs of UTI

Entity relations:
- Has_value("urine sample", "identical isolate")
- Has_value("CFU", ">= 1.000")
- Has_mood("UTI", "clinical signs")
- Subsumes("identical isolate", "CFU")
- OR("urine sample", "UTI")